Signed informed consent

The above is a clinical trial inclusion criterion. Annotated with entity spans:
[Informed_consent: Signed informed consent]